有關視神經脊髓炎（neuromyelitis optica, NMO）和多發性硬化症（multiple sclerosis, MS）的比較，下列敘述何者錯誤？
A. NMO 對於脊髓的侵犯通常都大於 3 節
B. NMO 之患者較容易出現 NMO-IgG 或 aquaporin-4 抗體
C. NMO 之患者急性復發時須使用靜脈注射大劑量的 methylprednisolone
D. β干擾素（interferon-β）和 glatiramer acetate 可以有效的預防 NMO 復發，其效果比預防 MS 復發更好

正確答案：D. β干擾素（interferon-β）和 glatiramer acetate 可以有效的預防 NMO 復發，其效果比預防 MS 復發更好